一位 5 歲男童有生長遲緩（growth failure），血液檢查顯示血中白血球數為 9,600/mm3，中性球 45%，淋巴球 48%，單核球 7%；血色素（hemoglobin）值為 11.6 g/dL；血小板數為 360,000/mm3；血中鉀離子濃度為 2.1 mmol/L，鈉離子濃度為 135 mmol/L，血中氯離子濃度為 101 mmol/L，血中pH 7.41，碳 酸根（HCO3-）離子濃度為 33.2 mmol/L，血中鎂離子濃度正常。請問下列何者為最有可能之診斷？
A. Bartter 氏症候群（Bartter syndrome）
B. Gitelman 氏症候群（Gitelman syndrome）
C. Fanconi 症候群（Fanconi syndrome）
D. 亞伯氏症候群（Alport syndrome）

正確答案：A. Bartter 氏症候群（Bartter syndrome）